How is the nuclear localization of lncRNA mediated?

The lncRNA localization to the nucleus can be mediated by the pentamer sequence AGCCC.